En un ensayo clínico se evalúa la no inferioridad del forbuterol frente a serbuterol, siendo la variable principal del estudio el volumen espiratorio forzado en el primer segundo (VEF1, medido en litros). El límite de no inferioridad se establece en -0,18 litros de diferencia absoluta. Los resultados muestran una diferencia en VEF1 entre forbuterol y serbuterol de +0,26 litros (intervalo de confianza al 95%: -0,15 a +0,40). Señale la respuesta correcta:
1. Forbuterol es no inferior a serbuterol.
2. Serbuterol es no inferior a forbuterol.
3. Forbuterol es no inferior a serbuterol y también superior, porque mejora en 0,26 litros el VEF1.
4. El estudio no es concluyente en cuanto a demostrar la no inferioridad de forbuterol.

Respuesta correcta: 1. Forbuterol es no inferior a serbuterol.